Patients with sensitivity to botulinum toxin or human albumin

The above is a clinical trial exclusion criterion. Annotated with entity spans:
Patients with [Condition: sensitivity] to [Drug: botulinum toxin] or [Drug: human albumin]